Previous post-exposure prophylaxis (PEP) use during the last 12 months.

The above is a clinical trial inclusion criterion. Annotated with entity spans:
Previous [Procedure: post-exposure prophylaxis] ([Procedure: PEP]) use [Temporal: during the last 12 months].